Clinical trial inclusion criterion:
Subjects = 19 or = 75 years of age

Entity relations:
- Has_value("age", "= 19 or = 75 years")